Clinical trial exclusion criterion:
use of immunosuppressive drugs, corticosteroids or anorexigen

Annotated entities:
- Drug: "immunosuppressive drugs"
- Drug: "corticosteroids"
- Drug: "anorexigen"